Clinical trial exclusion criterion:
Preoperative chronic opiate use for chronic pain defined as opiate usage at least 60 mg/day of morphine equivalent for = 3 months (as defined by International Association for the Study of Pain22) in the one year period prior to the bariatric surgery

Entity relations:
- Has_multiplier("opiate", "chronic")
- AND("opiate", "chronic pain")
- Has_temporal("opiate", "Preoperative")
- Has_multiplier("opiate", "at least 60 mg/day of morphine equivalent")
- Has_multiplier("opiate", "for = 3 months")
- multi("the bariatric surgery", "bariatric surgery")
- AND("in the one year period prior to the bariatric surgery", "bariatric surgery")
- Has_temporal("opiate", "in the one year period prior to the bariatric surgery")
- Subsumes("opiate", "opiate")
- Has_index("in the one year period prior to the bariatric surgery", "the bariatric surgery")